temperature=37.1<U+2103> and infectious diseases

The above is a clinical trial exclusion criterion. Annotated with entity spans:
[Measurement: temperature][Value: =37.1<U+2103>] and [Condition: infectious diseases]